Clinical trial inclusion criterion:
Existence of a contraceptive method for women of reproductive age

Entity relations:
- Has_value("age", "reproductive")
- AND("women", "age")
- AND("women", "contraceptive")